any previous treatment for the for adhesive capsulitis of the affected shoulder.

The above is a clinical trial exclusion criterion. Annotated with entity spans:
[Qualifier: any] [Temporal: previous] [Procedure: treatment] for the for [Condition: adhesive capsulitis] of the [Qualifier: affected shoulder].